Clinical trial exclusion criterion:
Women of childbearing potential must not be pregnant, planning to become pregnant during the study period, or nursing.

Annotated entities:
- Condition: "childbearing potential"
- Person: "Women"
- Negation: "not be"
- Condition: "pregnant"
- Mood: "planning to become"
- Condition: "pregnant"
- Temporal: "during the study period"
- Condition: "nursing"